Clinical trial exclusion criteria:
Type 1 diabetes, Secondary diabetes, gestational diabetes
Ongoing dementia treatment or anti-depressive disorder medication
Uncontrolled psychiatric disorder
BDI = 30 points
Heavy alcoholics
Underlying chronic liver disease (hemochromatosis, liver cell carcinoma, autoimmune liver disease, liver cirrhosis, chronic viral hepatitis)
Allergy or hypersensitivity to target medication or any of its components
Renal failure, moderate or severe renal impairment (estimated glomerular filtration rate < 30 mL/min/1.73 m2), or ongoing dialysis
Abnormal liver function (AST/ALT > x3 upper normal limit)
History of alcohol or drug abuse in the previous 3 months
Premenopausal women who are nursing or pregnant
Human immunodeficiency virus (HIV) or human immunodeficiency virus (AIDS)
chronic pancreatitis or pancreatic cancer

Annotated entities:
- Condition: "Type 1 diabetes"
- Condition: "Secondary diabetes"
- Condition: "gestational diabetes"
- Condition: "dementia"
- Procedure: "treatment"
- Drug: "anti-depressive disorder medication"
- Temporal: "Ongoing"
- Qualifier: "Uncontrolled"
- Measurement: "BDI"
- Value: "= 30 points"
- Qualifier: "Heavy"
- Condition: "alcoholics"
- Condition: "chronic liver disease"
- Condition: "hemochromatosis"
- Condition: "liver cell carcinoma"
- Condition: "autoimmune liver disease"
- Condition: "liver cirrhosis"
- Condition: "chronic viral hepatitis"
- Condition: "Allergy"
- Condition: "hypersensitivity"
- Drug: "target medication"
- Condition: "Renal failure"
- Qualifier: "moderate"
- Qualifier: "severe"
- Condition: "renal impairment"
- Measurement: "estimated glomerular filtration rate"
- Value: "< 30 mL/min/1.73 m2"
- Temporal: "ongoing"
- Procedure: "dialysis"
- Measurement: "liver function"
- Value: "Abnormal"
- Measurement: "AST/ALT"
- Value: "> x3 upper normal limit"
- Condition: "drug abuse"
- Condition: "alcohol abuse"
- Temporal: "in the previous 3 months"
- Condition: "Premenopausal"
- Person: "women"
- Condition: "nursing"
- Condition: "pregnant"
- Condition: "Human immunodeficiency virus (HIV)"
- Condition: "human immunodeficiency virus (AIDS)"
- Condition: "chronic pancreatitis"
- Condition: "pancreatic cancer"